Indication for Fresh Embryo transfer

The above is a clinical trial inclusion criterion. Annotated with entity spans:
[Mood: Indication for] [Procedure: Fresh Embryo transfer]